Patients who have received prior chemotherapy for unresectable disease

The above is a clinical trial exclusion criterion. Annotated with entity spans:
Patients who have received prior [Procedure: chemotherapy] for [Condition: unresectable disease]